Clinical trial inclusion criterion:
No history of GI pathology

Annotated entities:
- Condition: "GI pathology"
- Temporal: "history"
- Negation: "No"